Typical AMD and PCV patients

The above is a clinical trial inclusion criterion. Annotated with entity spans:
Typical [Condition: AMD] and [Condition: PCV patients]